La síntesis de fosfolípidos de membrana ocurre en:
1. Citosol.
2. Polirribosomas.
3. Retículo endoplásmico.
4. Complejo del Golgi.
5. Peroxisoma.

Respuesta correcta: 3. Retículo endoplásmico.